Diagnostic or therapeutic procedures

The above is a clinical trial inclusion criterion. Annotated with entity spans:
[Procedure: Diagnostic] or [Procedure: therapeutic procedures]